下列何種降血壓藥物的作用機轉是透過阻斷 AT1 receptor 而達成的？
A. Lisinopril
B. Diltiazem
C. Valsartan
D. Amiloride

正確答案：C. Valsartan